¿Cuál de las siguientes afirmaciones es correcta?
1. El radio atómico de flúor y cloro son idénticos.
2. El radio atómico del cloro es menor que el del flúor.
3. El bromo presenta el mayor radio atómico de los halógenos.
4. El flúor presenta el menor radio atómico de los halógenos.

Respuesta correcta: 4. El flúor presenta el menor radio atómico de los halógenos.